Wolff Parkinson White syndrome

The above is a clinical trial exclusion criterion. Annotated with entity spans:
[Condition: Wolff Parkinson White syndrome]